Clinical trial exclusion criterion:
History of hypersensitivity reactions to murine protein-containing products.

Annotated entities:
- Condition: "hypersensitivity reactions"
- Drug: "murine protein-containing products"
- Drug: "murine"